Clinical trial exclusion criterion:
Immunosuppresant host

Annotated entities:
- Condition: "Immunosuppresant host"